Which gene controls the expression of GATA-1 isoforms?

A transcriptional network has been reported, in which PU.1 positively regulates GATA-1 expression in mast cell development.